Severe uncorrected visual or auditory handicaps

The above is a clinical trial exclusion criterion. Annotated with entity spans:
[Qualifier: Severe] [Qualifier: uncorrected] visual or [Condition: auditory handicaps]